What percentage of rheumatoid arthritis patients are responsive to anti-TNF therapy?

treatment strategies blocking tumor necrosis factor (anti-tnf) have proven very successful in patients with rheumatoid arthritis (ra), showing beneficial effects in approximately 50-60% of the patients.